Other protocol-defined inclusion/exclusion criteria may apply

The above is a clinical trial exclusion criterion. Annotated with entity spans:
[Non-representable: Other protocol-defined inclusion/exclusion criteria may apply]